Clinical trial inclusion criteria:
Born at University of New Mexico Hospital
Greater than 34 weeks gestation
Primary in-utero drug exposure was opioids other than buprenorphine
Maternal or infant urine drug screen positive for methadone and/or opioids on admission

Annotated entities:
- Visit: "University of New Mexico Hospital"
- Person: "Born"
- Condition: "gestation"
- Value: "Greater than 34 weeks"
- Qualifier: "in-utero"
- Observation: "drug exposure"
- Drug: "opioids"
- Negation: "other"
- Drug: "buprenorphine"
- Qualifier: "Maternal"
- Qualifier: "infant"
- Measurement: "urine drug screen"
- Value: "positive"
- Qualifier: "methadone"
- Qualifier: "opioids"